Clinical trial inclusion criteria:
Approved clinical indication for pectoral pacemaker exchange (e.g. elective replacement indication (ERI), end of service (EOS))
a single or dual chamber MRI conditional pacemaker (BSCI) or
Any comparable successor IPG (MRI conditional system, BSCI) compatible with
Implanted Fineline-II-leads (BSCI), MRI conditional
The ascertained lead impedance is between 200 and 1500 Ohm.
All pacing capture thresholds (PCT) do not exceed 2.0 V @0.4 or 0.5 ms in pacemaker dependent patients
Male or female 18 years or older
Understand the nature of the procedure
Give written informed consent
Able to complete all testing required by the clinical protocol
Ability to measure atrial and/or ventricular pacing threshold(s) at 0.4 or 0.5 ms
Patient body height greater or equal to 140 cm
Pectoral implanted device
Subjects who are able and willing to undergo elective cardiac magnetic resonance (MR) scanning without sedation (MRI-group)
Subjects who are geographically stable and available for follow-up at the study center for the length of the study

Annotated entities:
- Condition: "elective replacement indication (ERI)"
- Condition: "end of service (EOS)"
- Condition: "clinical indication"
- Procedure: "pectoral pacemaker exchange"
- Qualifier: "single chamber"
- Qualifier: "dual chamber"
- Device: "pacemaker"
- Device: "BSCI"
- Qualifier: "MRI conditional"
- Device: "MRI conditional system"
- Device: "BSCI"
- Device: "successor IPG"
- Qualifier: "comparable"
- Device: "Implanted Fineline-II-leads"
- Device: "BSCI"
- Qualifier: "MRI conditional"
- Measurement: "ascertained lead impedance"
- Value: "between 200 and 1500 Ohm"
- Measurement: "pacing capture thresholds"
- Measurement: "PCT"
- Value: "do not exceed 2.0 V @0.4 or 0.5 ms"
- Condition: "pacemaker dependent"
- Person: "Male"
- Person: "female"
- Value: "18 years or older"
- Person: "years or older"
- Non-query-able: "Understand the nature of the procedure"
- Post-eligibility: "Give written informed consent"
- Post-eligibility: "Able to complete all testing required by the clinical protocol"
- Post-eligibility: "Ability to measure atrial and/or ventricular pacing threshold(s) at 0.4 or 0.5 ms"
- Measurement: "body height"
- Value: "greater or equal to 140 cm"
- Device: "Pectoral implanted device"
- Mood: "willing to undergo"
- Qualifier: "elective"
- Procedure: "cardiac magnetic resonance scanning"
- Procedure: "MR"
- Qualifier: "without sedation"
- Person: "geographically stable"
- Observation: "available for follow-up"
- Visit: "at the study center"
- Temporal: "for the length of the study"